Clinical trial inclusion criterion:
Serum erythropoietin <500 milliunits/milliliter (mU/mL) within 14 days prior to the first dose of study treatment

Annotated entities:
- Measurement: "Serum erythropoietin"
- Value: "<500 milliunits/milliliter"
- Temporal: "within 14 days prior to the first dose of study treatment"